Which de novo mutation in FGFR cause achondroplasia?

Recurrent missense mutations in a CpG doublet of the transmembrane domain of the FGFR3 protein (glycine substituted with arginine at residue 380, G380R).